下列有關乳糖不耐症（lactose intolerance）的敘述，何者錯誤？
A. 臨床可出現腹脹、腹瀉、腹痛、脹氣、放屁等症狀
B. 亞洲人90%左右有此困擾，而白種人則不到25%
C. 腹瀉屬於分泌性（secretory）腹瀉，停用乳糖製品可改善
D. 給病人補充乳糖酵素可以改善。含活的乳酸菌之優酪乳（yogurt）因可產生乳糖酵素，病人可以接受

正確答案：C. 腹瀉屬於分泌性（secretory）腹瀉，停用乳糖製品可改善